Patients' curator must be able to give voluntary consent.

The above is a clinical trial inclusion criterion. Annotated with entity spans:
[Non-query-able: Patients' curator must be able to give voluntary consent].